小明是一位人類免疫不全病毒（human immunodeficiency virus）感染發病者，目前正在接受抗反轉錄病毒藥物治療（antiretroviral therapy）。下列相關敘述，何者錯誤？
A. 肺囊蟲肺炎（Pneumocystis pneumonia）是愛滋病患最常見的肺部伺機性感染
B. 隨著抗反轉錄病毒藥物的使用，愛滋病患的伺機性感染已大幅減少
C. 服用抗反轉錄病毒藥物可能造成血脂肪上升、血糖上升等新陳代謝副作用
D. 接受治療者應定期追蹤 CD3 淋巴球數與病毒量

正確答案：D. 接受治療者應定期追蹤 CD3 淋巴球數與病毒量